La isoniazida es eficaz contra:
1. Brucella.
2. Mycoplasma.
3. Staphylococcus aureus.
4. Mycobacterium tuberculosis.
5. Bacillus anthracis.

Respuesta correcta: 4. Mycobacterium tuberculosis.